Clinical trial exclusion criterion:
are pregnant or think you might be pregnant

Annotated entities:
- Condition: "pregnant"
- Mood: "think you might be"
- Condition: "pregnant"